下列何者為最常見規則性的陣發性上心室頻脈（paroxysmal regular supraventricular tachycardia）？
A. 心房撲動（atrial flutter）
B. atrioventricular nodal reentry tachycardia（AVNRT）
C. 心房顫動（atrial fibrillation）
D. 多型性心房頻脈（multifocal atrial tachycardia）

正確答案：B. atrioventricular nodal reentry tachycardia（AVNRT）